signs of complicated UTI (e. g. temperature > 38°C, loin tenderness)

The above is a clinical trial exclusion criterion. Annotated with entity spans:
signs of [Condition: complicated UTI] (e. g. [Measurement: temperature] [Value: > 38°C], [Condition: loin tenderness])